Clinical trial exclusion criterion:
Known history of significant inflammatory disease, other than COPD (e.g. rheumatoid arthritis and systemic lupus erythematosus).

Entity relations:
- Has_negation("COPD", "other than")
- AND("inflammatory disease", "COPD")
- Subsumes("inflammatory disease", "rheumatoid arthritis")
- Has_qualifier("inflammatory disease", "significant")
- OR("rheumatoid arthritis", "systemic lupus erythematosus")